life expectancy of less than 18months

The above is a clinical trial exclusion criterion. Annotated with entity spans:
[Observation: life expectancy] of [Value: less than 18months]